Clinical trial inclusion criterion:
Score ≤ 10 on the Short Physical Performance Battery OR Walking speed < 1.2 m/sec during 400 m usual-paced test

Annotated entities:
- Measurement: "Short Physical Performance Battery"
- Value: "Score ≤ 10"
- Measurement: "Walking speed"
- Value: "< 1.2 m/sec"
- Procedure: "400 m usual-paced test"